Clinical trial exclusion criterion:
Patients with communication problems (critically ill, unconscious, language barrier despite use of secure telephone-based translation service)

Entity relations:
- Subsumes("communication problems", "critically ill")
- OR("critically ill", "unconscious", "language barrier")